Clinical trial inclusion criterion:
Duration of SCI =1 year;

Entity relations:
- Has_temporal("SCI", "=1 year")